Clinical trial inclusion criterion:
Patients undergoing ambulatory hand surgery for carpal tunnel and trigger finger, under local anesthesia with or without sedation.

Entity relations:
- AND("hand surgery", "carpal tunnel")
- Has_qualifier("hand surgery", "ambulatory")
- AND("hand surgery", "local anesthesia")
- AND("hand surgery", "trigger finger")